Clinical trial inclusion criterion:
Biliary obstructive symptoms or signs

Annotated entities:
- Condition: "Biliary obstructive symptoms"
- Condition: "Biliary obstructive signs"